Patients with angina or silent ischemia and documented ischemia

The above is a clinical trial inclusion criterion. Annotated with entity spans:
Patients with [Condition: angina] or [Qualifier: silent] [Condition: ischemia] [Grammar_Error: and] [Qualifier: documented] [Condition: ischemia]